一位 56 歲卡車司機發生車禍後，送到急診室時有盜汗現象，自訴胸痛、血壓 64/40 mmHg、呼吸頻率 40 次/分、心跳 110 次/分。下列敘述何者最能分辨出心包膜填塞（cardiac tamponade）與張力性氣胸（tension pneumothorax）？
A. 頻脈（tachycardia）
B. 脈壓（pulse pressure）
C. 頸靜脈壓（jugular venous pressure）
D. 呼吸音（breath sounds）

正確答案：D. 呼吸音（breath sounds）